Clinical trial exclusion criterion:
Absence of documentation of negative tuberculin skin test, negative QuantiFERON-TB Gold test, or treatment for latent tuberculosis prior to starting treatment with the anti-TNF agent

Entity relations:
- Has_value("tuberculin skin test", "negative")
- Has_negation("tuberculin skin test", "Absence of")
- Has_value("QuantiFERON-TB Gold test", "negative")
- Has_qualifier("tuberculosis", "latent")
- AND("treatment", "tuberculosis")
- multi("treatment with the anti-TNF agent", "anti-TNF agent")
- multi("starting treatment with the anti-TNF agent", "treatment with the anti-TNF agent")
- Has_index("prior to starting treatment with the anti-TNF agent", "starting treatment with the anti-TNF agent")
- Has_temporal("treatment", "prior to starting treatment with the anti-TNF agent")